Planned removal of more than 10 lung lesions

The above is a clinical trial exclusion criterion. Annotated with entity spans:
[Mood: Planned] [Procedure: removal] of [Multiplier: more than 10] [Condition: lung lesions]